Clinical trial exclusion criterion:
symptomatic atherosclerosis of the carotid artery;

Annotated entities:
- Condition: "atherosclerosis"
- Qualifier: "symptomatic"
- Qualifier: "of the carotid artery"